Clinical trial exclusion criterion:
Serum aminotransferase (AST or ALT) 3x upper limit of normal or higher

Annotated entities:
- Measurement: "Serum aminotransferase"
- Measurement: "AST"
- Measurement: "ALT"
- Value: "3x upper limit of normal or higher"